Physical limitations evidenced by either:

The above is a clinical trial inclusion criterion. Annotated with entity spans:
[Parsing_Error: Physical limitations evidenced by either:]